Ongoing hormone replacement therapy;

The above is a clinical trial exclusion criterion. Annotated with entity spans:
[Temporal: Ongoing] [Procedure: hormone replacement therapy];